Clinical trial inclusion criterion:
Age > 40 years (45)

Annotated entities:
- Person: "Age"
- Value: "> 40 years"